Clinical trial exclusion criterion:
diabetes mellitus

Annotated entities:
- Condition: "diabetes mellitus"